Clinical trial exclusion criterion:
Radiopaque material implanted in the chest wall (metal, silicone, etc.)

Entity relations:
- Has_qualifier("Radiopaque material", "chest wall")